Clinical trial exclusion criterion:
Limited life expectancy due to cancer or end-stage renal or liver disease

Annotated entities:
- Person: "life expectancy"
- Value: "Limited"
- Condition: "cancer"
- Condition: "end-stage renal disease"
- Condition: "liver disease"